Sensation of incomplete evacuation for =25% of defecations

The above is a clinical trial inclusion criterion. Annotated with entity spans:
[Condition: Sensation of incomplete evacuation] for [Multiplier: =25%] of [Condition: defecations]